How does trimetazidine affect intracellular kinase signaling in the heart?

Trimetazidine activates AMPK in diabetic myocardium. Trimetazidine  when administered before reperfusion results in activation of p38 mitogen-activated protein kinase and Akt signaling. Trimetazidine  when administered during reperfusion does not affect p38MAPK and JNK activation.